Which are the symptoms of glucose-6-phosphate dehydrogenase (G6PD) deficiency?

Glucose-6-phosphate dehydrogenase deficiency (G6PD deficiency) is the most common red blood cell (RBC) enzyme disorder. The decrease as well as the absence of the enzyme increase RBC vulnerability to oxidative stress caused by exposure to certain medications or intake of fava beans. Among the most common symptoms of this condition are:
1) acute hemolysis, 
2) chronic hemolysis, 
3) neonatal hyperbilirubinemia.